Clinical trial inclusion criteria:
end diastolic diameter >60 mm and/or an ejection fraction <50%
written informed consent
age >18 years

Annotated entities:
- Measurement: "end diastolic diameter"
- Value: ">60 mm"
- Measurement: "ejection fraction"
- Value: "<50%"
- Informed_consent: "written informed consent"
- Person: "age"
- Value: ">18 years"